Clinical trial inclusion criterion:
no clinical signs of infection

Annotated entities:
- Negation: "no"
- Mood: "clinical signs of"
- Condition: "infection"